Clinical trial inclusion criterion:
Bilirubin less than 1.5x upper limit of normal, AST less than 3x upper limit of normal, serum creatinine less than 1.5x normal and Hgb 8.0 g/dL or greater

Entity relations:
- Has_value("Bilirubin", "less than 1.5x upper limit of normal")
- Has_value("AST", "less than 3x upper limit of normal")